Clinical trial exclusion criterion:
Any systemic infection during the study.

Annotated entities:
- Condition: "infection"
- Qualifier: "systemic"
- Temporal: "during the study"
- Reference_point: "the study"